What percent of Rheumatoid Arthritis (RA) patients are not responding to anti-TNF therapy?

Despite this, a substantial proportion of patients (approximately 30-40%) fail to respond to these potentially toxic and expensive therapies.  Treatment strategies blocking tumor necrosis factor (anti-TNF) have proven very successful in patients with RA, showing beneficial effects in approximately 25% of the patients.